有關產前胎兒健康評估方法之敘述，下列何者錯誤？
A. 壓力收縮試驗（contraction stress test）呈現陽性屬不正常
B. 非壓力試驗（nonstress test）一般來說是 2 週做 1 次
C. 正常的非壓力試驗定義為在 20 分鐘的測驗內，有 2 次以上的心跳上升、每次超過平均心跳 15 下以上且每次要持續 15 秒以上
D. 若非壓力試驗做了 90 分鐘以上，仍然呈現 non-reactive 代表可能有週產期的病變

正確答案：B. 非壓力試驗（nonstress test）一般來說是 2 週做 1 次